Clinical trial inclusion criterion:
Patient with health coverage

Annotated entities:
- Observation: "health coverage"
- Context_Error: "health coverage"